Clinical trial exclusion criterion:
Intracranial bleed at any point.

Entity relations:
- Has_temporal("Intracranial bleed", "at any point")